Fasting LDL-C = 250mg/dL at the screening visit

The above is a clinical trial inclusion criterion. Annotated with entity spans:
[Measurement: Fasting LDL-C] [Value: = 250mg/dL] [Temporal: at the screening visit]